Clinical trial exclusion criterion:
pre- operative treatment with anti-emetics, steroids, or analgesics

Entity relations:
- AND("treatment", "anti-emetics")
- Has_temporal("treatment", "pre- operative")
- OR("anti-emetics", "steroids", "analgesics")